Clinical trial inclusion criterion:
ECOG Performance Status of 0 or 1.

Annotated entities:
- Measurement: "ECOG Performance Status"
- Value: "0 or 1"